Evidence of any GI disorder induced by an infection, underlying medical condition, or concomitant medication other than MPA

The above is a clinical trial exclusion criterion. Annotated with entity spans:
Evidence of any [Condition: GI disorder] [Qualifier: induced by an infection], [Condition: underlying medical condition], or concomitant [Drug: medication] [Negation: other than] [Drug: MPA]